Clinical trial exclusion criterion:
History of exercise-related syncope

Entity relations:
- Has_qualifier("syncope", "exercise-related")
- Has_temporal("syncope", "History")